Patient received apatinib treatment regimen at investigators' discretion;

The above is a clinical trial inclusion criterion. Annotated with entity spans:
Patient received [Drug: apatinib] treatment regimen at investigators' discretion;